Clinical trial inclusion criterion:
Patients scheduled for laser laryngeal surgery under general anesthesia with either Propofol or desflurane based technique.

Annotated entities:
- Mood: "scheduled"
- Procedure: "laser laryngeal surgery"
- Procedure: "general anesthesia"
- Drug: "Propofol"
- Drug: "desflurane"